依順序排列出精子成熟至受精的過程： ①頂體反應（acrosomal reaction）  ②皮層反應（cortical  reaction） ③獲能（capacitation） ④射精（ejaculation）
A. ①②③④
B. ④③②①
C. ④③①②
D. ①②④③

正確答案：C. ④③①②